下列何者不是全靜脈營養（total parenteral nutrition）之適應症？
A. 嚴重頭部外傷引起之昏迷
B. 長期腸麻痺（prolonged ileus）
C. 腸道－皮瘻管（entero-cutaneous fistula）
D. 短腸症（short bowel syndrome）

正確答案：A. 嚴重頭部外傷引起之昏迷